Clinical trial inclusion criterion:
full term singleton pregnant women

Entity relations:
- Has_qualifier("pregnant", "singleton")
- Has_qualifier("pregnant", "full term")